Clinical trial inclusion criterion:
ASA Class I and II, eligible for endoscopic or surgical treatment with curative intent,

Entity relations:
- Has_value("ASA Class", "I")
- Has_qualifier("surgical treatment", "with curative intent")
- Has_mood("surgical treatment", "eligible for")
- AND("surgical treatment", "ASA Class")
- OR("I", "II")
- OR("surgical treatment", "treatment endoscopic")